Able to comply with protocol requirements. Healthy on the basis of a medical evaluation that reveals the absence of any clinically relevant abnormality and includes a physical examination, medical history, electrocardiogram (ECG), vital signs, and the results of blood biochemistry, blood coagulation, and hematology tests and a urinalysis carried out at screening.

The above is a clinical trial inclusion criterion. Annotated with entity spans:
[Observation: Able to comply with protocol requirements]. [Condition: Healthy] on the basis of a [Procedure: medical evaluation] that reveals the [Negation: absence] of any [Qualifier: clinically relevant] [Condition: abnormality] and includes a [Procedure: physical examination], [Procedure: medical history], [Procedure: electrocardiogram] ([Procedure: ECG]), [Procedure: vital signs], and the results of [Procedure: blood biochemistry], [Procedure: blood coagulation], and [Procedure: hematology tests] and a [Procedure: urinalysis] carried out [Temporal: at screening].